Clinical trial exclusion criterion:
Patient is unable to complete 3 minutes of unloaded peddling on cycle ergometer

Annotated entities:
- Observation: "unable to complete"
- Qualifier: "3 minutes of unloaded peddling on cycle ergometer"